28歲工人，工作時搬運重物滑倒撞及肩膀，腋下瘀青腫脹疼痛，發現手臂麻木且無力抬高。經X光檢查後並無骨折或脫臼情形。此病患最有可能是下列那一條神經受傷？
A. 正中神經（median nerve）
B. 尺神經（ulnar nerve）
C. 橈神經（radial nerve）
D. 臂神經叢（brachial plexus）

正確答案：D. 臂神經叢（brachial plexus）